increased risk of bradycardia events (Sick Sinus, AV block grade II or III, bradycardia-induced syncope)

The above is a clinical trial inclusion criterion. Annotated with entity spans:
[Mood: increased risk] of [Condition: bradycardia events] ([Condition: Sick Sinus], [Condition: AV block] [Measurement: grade] [Value: II or III], [Condition: bradycardia-induced syncope])